有關帕金森氏病（Parkinson's disease）的復健治療，下列何者最不常被使用？
A. 因病人動作緩慢與協調失常，可使用跑步機（treadmill）作體能訓練
B. 使用帶輪子助行器（rolling walker）協助維持病人活動功能
C. 用阻力運動（resistance exercise）與柔軟運動（flexibility exercise）治療改善病人體能
D. 病人接受復健治療時，常需要視聽與觸感等各種感覺的提示（cues）

正確答案：A. 因病人動作緩慢與協調失常，可使用跑步機（treadmill）作體能訓練